Clinical trial inclusion criterion:
American Society of Anaesthesiologists (ASA) 2 and stable ASA 3 patients

Entity relations:
- Subsumes("American Society of Anaesthesiologists", "ASA")
- Has_qualifier("ASA", "stable")
- Has_value("ASA", "3")
- Has_value("American Society of Anaesthesiologists", "2")
- OR("American Society of Anaesthesiologists", "ASA")